Clinical trial exclusion criterion:
Contraindication to general anesthesia,

Entity relations:
- AND("Contraindication", "general anesthesia")